Other condition that the Investigator believes puts the patient at risk for a complication during the procedure

The above is a clinical trial exclusion criterion. Annotated with entity spans:
[Non-query-able: Other condition that the Investigator believes puts the patient at risk for a complication during the procedure]